3歲的女童因全身水腫，體重增加2公斤就診。體表面積Body surface area （BSA）為0.5m2，實驗檢查發現蛋白尿4+，24小時蛋白尿為3.3gm，單次尿液檢查：尿蛋白（Urine protein） 250 mg/dL，尿肌酸酐（Urine creatinine）50 mg/dL，血中白蛋白為1.5 gm/dL，膽固醇：420 mg/dL，三酸	油脂：248 mg/dL，下列相關敘述何者錯誤？
A. 應立即以Statin類降血脂藥物治療高血脂
B. 一般是原發性，不用腎臟切片，可先用類固醇治療
C. 蛋白尿的量已達到Nephrotic range proteinuria的定義
D. 若患者對類固醇反應良好則預後好，很少會進展到慢性腎臟病而須透析治療

正確答案：A. 應立即以Statin類降血脂藥物治療高血脂